Clinical trial exclusion criterion:
Comorbid major depressive disorder diagnosis which predates OCD diagnosis

Entity relations:
- Has_qualifier("major depressive disorder", "Comorbid")
- Has_index("predates OCD diagnosis", "OCD diagnosis")
- Has_temporal("major depressive disorder", "predates OCD diagnosis")